Clinical trial inclusion criterion:
Corneal staining < grade III on the Oxford scale

Entity relations:
- Has_qualifier("< grade III", "Oxford scale")
- Has_qualifier("Corneal staining", "< grade III")
- Has_qualifier("< grade III", "Oxford scale")